¿Para qué enfermedad se ha desarrollado la Terapia Psicológica Adyuvante de Moorey y Greer?:
1. Fibromialgia.
2. Cáncer.
3. Colon irritable.
4. Asma bronquial.
5. Hipertensión.

Respuesta correcta: 2. Cáncer.